Clinical trial inclusion criterion:
Inpatient or outpatient age 8-19 years inclusive; participants must live with a parent, guardian, or caregiver;

Entity relations:
- OR("Inpatient", "outpatient")